Clinical trial inclusion criterion:
Tobacco use: Subjects with a current or prior history of >=10 pack-years of cigarette smoking at screening (Visit 1). Previous smokers are defined as those who have stopped smoking for at least 6 months prior to Visit 1.

Annotated entities:
- Multiplier: ">=10 pack-years"
- Observation: "cigarette smoking"
- Temporal: "at screening"
- Temporal: "history"
- Temporal: "prior"
- Temporal: "current"
- Condition: "Previous smokers"
- Observation: "stopped smoking"
- Temporal: "for at least 6 months prior to Visit 1"
- Reference_point: "Visit 1"